Which test is used for the definition of colour-blindness?

12 patients had color blindness based on the Ishihara test